Primary periampullary tumor

The above is a clinical trial inclusion criterion. Annotated with entity spans:
[Qualifier: Primary] [Condition: periampullary tumor]